Show results of randomised controlled trials for certolizumab pegol.

Improvement of clinical results (ACR50, 28 joint disease activity score (DAS-28) remission and HAQ scores) with certolizumab pegol. Adverse events were more frequent with certolizumab; there was a statistically significant increase in the number of serious adverse events, infections and hypertension.
Randomised controlled trials (RCTs) of CZP have demonstrated rapid improvements in workplace and home productivity.